Clinical trial exclusion criterion:
Weight > 220 pounds

Entity relations:
- Has_value("Weight", "> 220 pounds")